Clinical trial exclusion criterion:
proliferative retinopathy or autonomic neuropathy;

Annotated entities:
- Condition: "proliferative retinopathy"
- Condition: "autonomic neuropathy"